Clinical trial inclusion criterion:
All subjects are written informed consent.

Annotated entities:
- Informed_consent: "All subjects are written informed consent"